Healthy subjects as established by medical history and clinical examination before entering into the study. Healthy subjects with no medical conditions that, in the opinion of the investigator, prevents the subject from participating in the study.

The above is a clinical trial inclusion criterion. Annotated with entity spans:
[Condition: Healthy] subjects as established by [Temporal: medical history] and [Procedure: clinical examination] [Temporal: before entering into the study]. [Non-query-able: Healthy subjects with no medical conditions that, in the opinion of the investigator, prevents the subject from participating in the study.]